下列有關大血管轉位（transposition of great vessels）先天性心臟病的敘述，何者最不適當？
A. 主動脈連接右心室
B. 肺動脈連接左心室
C. 升主動脈位於肺動脈幹左後方
D. 左心室壁會變較薄

正確答案：C. 升主動脈位於肺動脈幹左後方